Clinical trial exclusion criterion:
A daily alcohol intake >2 units/day.

Annotated entities:
- Observation: "alcohol"
- Multiplier: ">2 units/day"